¿Qué significa que la hemoglobina une O2 cooperativamente?
1. Que la unión de una molécula de O2 a una subunidad de la hemoglobina impulsa la unión de otras subunidades para formar una proteína hemoglobina completa.
2. Que la unión de una molécula de O2 a una subunidad de la hemoglobina aumenta la afinidad de la misma subunidad para unir más moléculas de O2.
3. Que la unión de una molécula de O2 a una subunidad de la hemoglobina aumenta la afinidad de otras subunidades por el O2.
4. Que la unión de una molécula de O2 a una proteína hemoglobina provoca la unión de otra molécula de O2 a otra proteína hemoglobina diferente.
5. Nada de lo anterior es cierto.

Respuesta correcta: 3. Que la unión de una molécula de O2 a una subunidad de la hemoglobina aumenta la afinidad de otras subunidades por el O2.